Clinical trial inclusion criterion:
Patients must be on stable hypoglycemic medications for at least 8 weeks prior to Visit 2 ( Day -1).

Annotated entities:
- Drug: "hypoglycemic medications"
- Temporal: "at least 8 weeks prior to Visit 2"
- Qualifier: "stable"
- Reference_point: "Visit 2"